What is the gene mutated in the Gaucher disease?

The glucocerebrosidase gene (GBA)